via transfemoral access

The above is a clinical trial inclusion criterion. Annotated with entity spans:
via [Procedure: transfemoral access]